下列何者能與單股DNA序列（5'）AGACTGGTC（3'）最穩定的雜交（hybridization）？
A. （5'）CTGGTCAGA（3'）
B. （5'）GACCAGTCT（3'）
C. （5'）AGACTGGTC（3'）
D. （5'）TCTGACCAG（3'）

正確答案：B. （5'）GACCAGTCT（3'）